Clinical trial inclusion criterion:
Patient is at least 18 at the day of screening.

Entity relations:
- Has_index("at least 18 at the day of screening", "screening")